¿A qué escuela sistémica caracteriza la máxima “La solución es el problema”? :
1. La escuela estructural.
2. La escuela psicodramática.
3. La escuela interaccional del Mental Research Institute (MRI).
4. La escuela estratégica.
5. La escuela de Milán.

Respuesta correcta: 3. La escuela interaccional del Mental Research Institute (MRI).